有關男性假陰陽人（male pseudohermaphroditism）之特徵，下列何者錯誤？
A. testosterone分泌不足
B. 染色體是46, XX
C. 不含性染色質（sex chromatin）
D. 睪丸發育可能正常或退化

正確答案：B. 染色體是46, XX